Clinical trial exclusion criterion:
any current (or within past 2 months) medical condition requiring medication that would interact with dronabinol or interfere with the study protocol

Entity relations:
- Subsumes("current", "within past 2 months")
- Has_mood("dronabinol", "would interact with")
- AND("medication", "dronabinol")
- AND("medical condition", "medication")
- Has_temporal("medical condition", "current")
- OR("dronabinol", "interfere with the study protocol")